Clinical trial exclusion criterion:
current prohibited concomitant medication

Annotated entities:
- Drug: "medication"
- Temporal: "concomitant"
- Temporal: "current"
- Qualifier: "prohibited"